Clinical trial exclusion criterion:
Severe liver dysfunction (LFT 3X upper limit of normal)

Annotated entities:
- Condition: "liver dysfunction"
- Qualifier: "Severe"
- Measurement: "LFT"
- Value: "3X upper limit of normal"